¿A qué tipo de validez hace referencia el grado de confianza con el que puede inferirse que las relaciones de causa-efecto entre las variables de una investigación son interpretables en el sentido sugerido por el investigador?
1. Validez interna.
2. Validez externa.
3. Validez discriminante.
4. Validez ecológica.
5. Validez de constructo.

Respuesta correcta: 1. Validez interna.